A pre-bronchodilatory forced expiratory flow in 1 second (FEV1) at Visit 1 (Screening) >=80% predicted. There should be no Short acting beta-agonist (SABA) use within 4 hours of this measurement.

The above is a clinical trial inclusion criterion. Annotated with entity spans:
A [Qualifier: pre-bronchodilatory] [Measurement: forced expiratory flow in 1 second (FEV1)] [Temporal: at Visit 1 (Screening)] [Value: >=80% predicted]. There should be [Negation: no] [Drug: Short acting beta-agonist (SABA)] use [Temporal: within 4 hours of this measurement].